Clinical trial exclusion criterion:
Patient has history of loose or watery stools

Entity relations:
- Has_temporal("loose stools", "history of")
- OR("loose stools", "watery stools")